All patients of childbearing and child-creating age must be using an acceptable form of birth control

The above is a clinical trial inclusion criterion. Annotated with entity spans:
[Post-eligibility: All patients of childbearing and child-creating age must be using an acceptable form of birth control]